Clinical trial inclusion criterion:
Patient must give written informed consent before participating in any study-specific procedure, randomization, or receiving investigational product.

Annotated entities:
- Observation: "informed consent"
- Temporal: "before participating in any study-specific procedure, randomization, or receiving investigational product"
- Reference_point: "participating in any study-specific procedure, randomization, or receiving investigational product"
- Qualifier: "study-specific"
- Procedure: "procedure"
- Procedure: "randomization"
- Drug: "investigational product"